有關於甲狀腺功能低下病人之相關敘述，下列那一項正確？
A. 身體診查時可能發現甲狀腺有瀰漫性腫大
B. 不會出現甲狀腺癌
C. 如果是老年人，應立即給予足量甲狀腺素，使功能儘速恢復正常
D. 一旦發現懷孕，應立即停用甲狀腺素

正確答案：A. 身體診查時可能發現甲狀腺有瀰漫性腫大